The formation of which inflammatory molecule is regulated by MAP3K8 (TPL2)?

MAP3K8 (also known as Map3k8) regulates the formation of IL-1β